Clinical trial inclusion criterion:
6. Has a negative pregnancy test at the Screening visit. An exception for the pregnancy test requirement will be granted for subjects reporting surgical sterilization in medical history

Annotated entities:
- Parsing_Error: "6."
- Measurement: "pregnancy test"
- Value: "negative"
- Temporal: "at the Screening visit"
- Reference_point: "Screening visit"
- Parsing_Error: "An exception for the pregnancy test requirement will be granted for subjects reporting surgical sterilization in medical history"
- Not_a_criteria: "An exception for the pregnancy test requirement will be granted for subjects reporting surgical sterilization in medical history"